Clinical trial inclusion criterion:
Adult men and women (=18 years).

Annotated entities:
- Person: "men"
- Person: "Adult"
- Person: "women"
- Value: "=18 years"
- Person: "years"